proven pelvic floor dysfunction

The above is a clinical trial inclusion criterion. Annotated with entity spans:
proven [Condition: pelvic floor dysfunction]